Clinical trial inclusion criterion:
Temperature 35-37.9°C (95-100.3°F)

Annotated entities:
- Measurement: "Temperature"
- Value: "35-37.9°C"
- Value: "95-100.3°F"